Clinical trial inclusion criterion:
Increased waist circumference (=102 cm in men; =88 cm in women)

Annotated entities:
- Measurement: "waist circumference"
- Value: "Increased"
- Value: "=102 cm"
- Value: "=88 cm"
- Person: "women"
- Person: "men"